Clinical trial exclusion criterion:
History of clinically significant allergy or adverse event with protease inhibitors

Annotated entities:
- Condition: "allergy"
- Condition: "adverse event"
- Drug: "protease inhibitors"